若病人出現縮瞳（miosis），一側面部出汗減少（anhydrosis），上眼瞼下垂（ptosis）等 Horner 徵候群，其三種典型臨床症狀皆出現時，最不可能為下列何種疾病所引發？
A. 頸總動脈剝離（common carotid artery dissection）
B. 頸外動脈（external carotid artery）損傷
C. 腦幹栓塞性中風（brainstem infarction）
D. 頸上神經節（superior cervical ganglion）損傷

正確答案：B. 頸外動脈（external carotid artery）損傷